Clinical trial exclusion criterion:
RA cohort: Previous intolerance to MTX

Annotated entities:
- Condition: "RA"
- Condition: "intolerance"
- Drug: "MTX"